Clear indication for specific duration of dual anti-platelet therapy

The above is a clinical trial exclusion criterion. Annotated with entity spans:
[Condition: Clear indication for specific duration] of [Procedure: dual anti-platelet therapy]